男性不孕症的"睪丸切片＂檢查適合什麼情況下執行?
A. 所有精液分析有少精者
B. 無精症合併果酸陰性者（fructose-negative）
C. 無精症且血中 FSH 濃度過高者
D. 無精症且血中 FSH 濃度正常者

正確答案：D. 無精症且血中 FSH 濃度正常者